Clinical trial exclusion criterion:
Arterial disease (ABPI<0.8)

Entity relations:
- Has_value("ABPI", "<0.8")
- Subsumes("Arterial disease", "ABPI")